Known hypersensitivity to rifampin or rifabutin.

The above is a clinical trial exclusion criterion. Annotated with entity spans:
Known [Condition: hypersensitivity] to [Drug: rifampin] or [Drug: rifabutin].